Clinical trial exclusion criterion:
Cardiopulmonary instability (including pulmonary edema, cardiac insufficiency, myocardial infarction, acidosis and hemodynamic instability requiring significant vasopressor support)

Annotated entities:
- Condition: "Cardiopulmonary instability"
- Condition: "pulmonary edema"
- Condition: "cardiac insufficiency"
- Condition: "myocardial infarction"
- Condition: "acidosis"
- Condition: "hemodynamic instability"
- Qualifier: "vasopressor support"
- Qualifier: "significant"
- Drug: "vasopressor"